Los linfocitos Tα CD4+:
1. Son funcionalmente cooperadores con linfocitos B y con otros linfocitos T.
2. Reconocen antígenos nativos en forma soluble.
3. Reconocen péptidos en el contexto MHC de clase I.
4. Son menos abundantes que los CD8+ en sangre humana.
5. Liberan perforinas.

Respuesta correcta: 1. Son funcionalmente cooperadores con linfocitos B y con otros linfocitos T.